Clinical trial inclusion criterion:
Body mass index >85%ile for age and sex by standard growth charts;

Entity relations:
- Has_value("Body mass index", ">85%ile")